若病人出現周圍型顏面神經（facial palsy of peripheral type）損傷，且合併同側舌頭前三分之二味覺喪失，其損傷部位最不可能在：
A. 膝狀神經節（geniculate ganglion）附近
B. 中耳鼓室（tympanic cavity）
C. 內聽道（internal acoustic meatus）附近
D. 顏面神經穿過腮腺（parotid gland）處

正確答案：D. 顏面神經穿過腮腺（parotid gland）處